Patients with disorders of calcium metabolism and/or hypercalcemia

The above is a clinical trial exclusion criterion. Annotated with entity spans:
Patients with [Condition: disorders of calcium metabolism] and/or [Condition: hypercalcemia]